What is the origin of  HEp-2 cells?

human larynx epidermoid carcinoma cell line (HEp-2)